How many genes belong to the KRAB-ZNF family in the human genome?

There are 70 human KRAB-ZNFs.